Persons with a history of severe allergic reaction after previous vaccinations or hypersensitivity to any seasonal influenza vaccine component

The above is a clinical trial exclusion criterion. Annotated with entity spans:
Persons with a [Temporal: history] of [Qualifier: severe] [Condition: allergic reaction] [Temporal: after previous vaccinations] or [Condition: hypersensitivity to any seasonal influenza vaccine component]